What type of genome, (RNA or DNA, double stranded single stranded) is found in the the virus that causes blue tongue disease?

bluetongue virus (btv) genome contains ten double-stranded rna segments.